HIV positive or active HBV infection or other uncontrolled systematic infection

The above is a clinical trial exclusion criterion. Annotated with entity spans:
[Condition: HIV positive] or [Condition: active HBV infection] or other [Qualifier: uncontrolled] [Condition: systematic infection]